H. Pylori eradication within 2 months before study entry.

The above is a clinical trial exclusion criterion. Annotated with entity spans:
[Procedure: H. Pylori eradication] [Temporal: within 2 months before study entry].